Clinical trial inclusion criterion:
4. Karnofsky/Lansky score of ≥ 50

Annotated entities:
- Parsing_Error: "4."
- Measurement: "Karnofsky/Lansky score"
- Value: "≥ 50"